下列引起黃疸（jaundice）的病因中，何者為膽紅素（bilirubin）產生過多、超出正常肝臟內所能接合 （conjugation）的能力範圍？
A. 急性肝炎
B. 溶血性疾病
C. 總膽管結石
D. 胰臟頭部癌

正確答案：B. 溶血性疾病